Clinical trial inclusion criterion:
sexual relationship only with female partners

Annotated entities:
- Non-query-able: "sexual relationship only with female partners"